Clinical trial exclusion criterion:
Blood disorders or coagulopathy.

Annotated entities:
- Condition: "Blood disorders"
- Condition: "coagulopathy"